75 歲老婦人主訴右側膝關節腫痛已 2 天。理學檢查發現該膝關節有明顯的紅腫熱及壓痛。下列那一項檢查最具診斷的價值？
A. 關節液抽取及分析
B. 膝關節之斷層掃描
C. Rheumatoid factor 及 ESR、CRP 檢查
D. 血中尿酸之測定

正確答案：A. 關節液抽取及分析